下列何者不是安寧緩和醫療中常用的鎮靜或止痛藥物？
A. Morphine
B. Demerol（pethidine, meperidine）
C. Dormicum（midazolam）
D. Valium（diazepam）

正確答案：B. Demerol（pethidine, meperidine）